Clinical trial exclusion criterion:
History of sensitivity to heparin or heparin-induced thrombocytopenia.

Annotated entities:
- Condition: "sensitivity to heparin"
- Drug: "heparin"
- Condition: "heparin-induced thrombocytopenia"
- Qualifier: "heparin-induced"
- Drug: "heparin"